Clinical trial inclusion criterion:
At the discretion of the operating surgeon, ANC>1000/mcl and platelets>100,000/mcl.

Annotated entities:
- Subjective_judgement: "At the discretion of the operating surgeon"
- Measurement: "ANC"
- Value: ">1000/mcl"
- Measurement: "platelets"
- Value: ">100,000/mcl"